Women of child bearing potential unless they are using a birth control method

The above is a clinical trial exclusion criterion. Annotated with entity spans:
[Person: Women] of [Condition: child bearing potential] [Negation: unless] they are using a [Procedure: birth control method]